Clinical trial exclusion criterion:
Genetic and metabolic diseases.

Entity relations:
- OR("Genetic diseases", "metabolic diseases")